¿Cuál de las siguientes afirmaciones relacionadas con el cáncer de mama es correcta?:
1. El carcinoma ductal infiltrativo es el tipo histológico menos frecuente (alrededor de un 510%)
2. Si el tumor se localiza en el pezón se le denomina enfermedad de Paget.
3. La mastectomía total implica la escisión de la mama, el complejo areola-pezón y la disección ganglionar linfática axilar.
4. No produce metástasis en el tejido óseo.
5. Cuando existe metástasis está contraindicada la terapia hormonal.

Respuesta correcta: 2. Si el tumor se localiza en el pezón se le denomina enfermedad de Paget.